no positive pregnancy test or breast feeding at screening

The above is a clinical trial exclusion criterion. Annotated with entity spans:
no [Value: positive] [Procedure: pregnancy test] or [Observation: breast feeding] [Temporal: at screening]